在尿素（urea）循環中，尿素由 NH4+和 CO2 形成。氨（ammonia）對人體毒性很大，但尿素則無毒性，而且可溶於水，可由尿中排出體外。下列那一項對 carbamoyl phosphate synthetase I 的敘述錯誤？
A. 它是細胞質內的酵素
B. 它所催化之反應需要 ATP
C. 它以 HCO3-及 NH4+為反應之受質
D. 它所催化之反應形成了 carbamoyl phosphate 48 Phenylketonuria 與下列何項酵素缺陷有關？

正確答案：A. 它是細胞質內的酵素